Chronic or acute pain requiring prescription pain medication(s) (narcotic or synthetic narcotic)

The above is a clinical trial exclusion criterion. Annotated with entity spans:
[Qualifier: Chronic] or [Qualifier: acute] [Condition: pain] requiring [Drug: prescription pain medication](s) ([Drug: narcotic] or [Drug: synthetic narcotic])